Clinical trial exclusion criterion:
History of intracranial hemorrhage;

Annotated entities:
- Condition: "intracranial hemorrhage"